Must be capable of giving written informed connect for participation in the study for 24 months.

The above is a clinical trial inclusion criterion. Annotated with entity spans:
[Post-eligibility: Must be capable of giving written informed connect for participation in the study for 24 months.]